La presencia de un grupo atractor de electrones en la cadena del grupo acilo de las penicilinas aumenta su estabilidad en medio ácido porque:
1. Aumenta la basicidad del nitrógeno puente.
2. Disminuye la nucleofilia del oxígeno amídico de la cadena.
3. Disminuye la basicidad del nitrógeno de la posición 6.
4. Obliga a la cadena a adoptar una conformación que impide la reacción de inactivación.

Respuesta correcta: 2. Disminuye la nucleofilia del oxígeno amídico de la cadena.